Clinical trial exclusion criterion:
Patients with an established infection (diagnostic test required) e.g. acute malaria, dengue, leptospirosis, typhoid, Japanese encephalitis etc.

Entity relations:
- AND("infection", "diagnostic test")
- Subsumes("infection", "acute malaria")
- OR("acute malaria", "typhoid", "leptospirosis", "dengue", "Japanese encephalitis")